Clinical trial inclusion criteria:
full term
singleton pregnant women
scheduled for elective cesarean delivery

Annotated entities:
- Condition: "full term"
- Qualifier: "singleton"
- Condition: "pregnant"
- Person: "women"
- Qualifier: "elective"
- Procedure: "cesarean delivery"
- Mood: "scheduled for"